DSM-IV-TR major depressive disorder

The above is a clinical trial inclusion criterion. Annotated with entity spans:
[Qualifier: DSM-IV-TR] [Condition: major depressive disorder]